Clinical trial inclusion criterion:
Overweight or obesity (BMI =25 kg/m2)

Annotated entities:
- Condition: "obesity"
- Measurement: "BMI"
- Value: "=25 kg/m2"
- Condition: "Overweight"